Clinical trial exclusion criterion:
Previous biliary drainage by ERCP/PTC

Entity relations:
- Has_temporal("biliary drainage by ERCP/PTC", "Previous")